血睪屏障（blood testis barrier）具有保護下列何種細胞之功能？
A. Leydig cells
B. myoid cells
C. fibroblasts
D. primary spermatocytes

正確答案：D. primary spermatocytes